Clinical trial inclusion criterion:
>= 18 years

Annotated entities:
- Person: "years"
- Value: ">= 18"